Clinical trial exclusion criterion:
Beck's Depression Inventory (BDI) =14

Annotated entities:
- Measurement: "Beck's Depression Inventory (BDI)"
- Value: "=14"